No frozen embryos after IVF cycle

The above is a clinical trial exclusion criterion. Annotated with entity spans:
[Negation: No] [Observation: frozen embryos] after [Procedure: IVF cycle]